Current use of gabapentin or pregabalin

The above is a clinical trial exclusion criterion. Annotated with entity spans:
[Temporal: Current] use of [Drug: gabapentin] or [Drug: pregabalin]